Clinical trial inclusion criterion:
Normal renal function.

Annotated entities:
- Condition: "renal function"
- Qualifier: "Normal"